下列何種藥物是 cyanide 中毒時的 佳解毒劑？
A. Hydroxocobalamin
B. Acetylcysteine
C. Physostigmine
D. Pralidoxime

正確答案：A. Hydroxocobalamin